Patients in recent receipt of live vaccinations within 4 weeks prior to enrolment

The above is a clinical trial exclusion criterion. Annotated with entity spans:
Patients in recent receipt of [Drug: live vaccinations] [Temporal: within 4 weeks prior to enrolment]